Clinical trial inclusion criterion:
Subjects scheduled for laparoscopic unilateral inguinal hernia repair

Annotated entities:
- Mood: "scheduled"
- Qualifier: "laparoscopic"
- Procedure: "inguinal hernia repair"
- Qualifier: "unilateral"